Clinical trial exclusion criterion:
Contraindications to progestogens or oral contraceptive pills

Entity relations:
- AND("Contraindications", "progestogens")
- OR("progestogens", "oral contraceptive pills")